Newly diagnosed glioblastoma (GBM), WHO grade IV.

The above is a clinical trial inclusion criterion. Annotated with entity spans:
[Qualifier: Newly diagnosed] [Condition: glioblastoma] ([Condition: GBM]), [Measurement: WHO] [Value: grade IV].